Clinical trial exclusion criterion:
BMI < 20

Annotated entities:
- Measurement: "BMI"
- Value: "< 20"